Un hombre de 68 años con antecedentes de diabetes de 20 años de evolución, hipertensión arterial y prostatismo en tratamiento, consulta por episodios repetidos de síncope. Los episodios han ocurrido estando de pie, tras las comidas y se han precedido de un dolor opresivo en nuca, cuello y cintura escapular. ¿Cuál de estas pruebas complementarias es imprescindible?
1. RM cerebral y cervical.
2. Angio-RM de los troncos supra-aórticos.
3. Estudio     de    medicina     nuclear    del transportador de dopamina (SPECT con ioflupano) cerebral.
4. Medición de la presión arterial en decúbito y bipedestación.
5. Registro Holter de 24 horas del electrocardiograma.

Respuesta correcta: 4. Medición de la presión arterial en decúbito y bipedestación.